How many patients were enrolled in the FREEDOMS clinical trial?

FREEDOMS study, a randomised, double-blind study included 1272 patients with relapsing-remitting MS.